下列淋巴器官中，何者不含淋巴小結（lymphatic nodules）或濾泡（follicles）？
A. 淋巴結（lymph nodes）
B. 脾（spleen）
C. 胸腺（thymus）
D. 培氏斑（Peyer's patches）

正確答案：C. 胸腺（thymus）